Clinical trial exclusion criterion:
In which a cardiac catheterization is planned a priori to be performed via femoral, brachial or ulnar.

Annotated entities:
- Procedure: "cardiac catheterization"
- Qualifier: "femoral"
- Qualifier: "brachial"
- Qualifier: "ulnar"